Clinical trial exclusion criterion:
Drug abuse

Annotated entities:
- Condition: "Drug abuse"